以下何種神經傳遞物質（neurotransmitter）在哺乳類中樞神經系統之 reward system 中扮演最重要的角色？
A. Dopamine
B. Epinephrine
C. Glycine
D. Acetylcholine

正確答案：A. Dopamine